Body weight greater than 33.4 kg and a healthy weight using age-based body mass index (BMI) range 5th-85th percentile at screening and baseline. Appendix 3 contains BMI-for-age charts that can be consulted.

The above is a clinical trial inclusion criterion. Annotated with entity spans:
[Measurement: Body weight] [Value: greater than 33.4 kg] and a healthy weight using age-based [Measurement: body mass index] ([Measurement: BMI]) range [Value: 5th-85th percentile] at screening and baseline. Appendix 3 contains BMI-for-age charts that can be consulted.